Clinical trial exclusion criteria:
long-term use of analgesics,sedatives or non steroidal anti-inflammatory drugs history.
known for dexmedetomidine or other drugs allergy in this study.
cannot communicate.
preoperative systolic blood pressure <90 mmHg, or the heart rate <50/min.

Annotated entities:
- Multiplier: "long-term use"
- Drug: "analgesics"
- Drug: "sedatives"
- Drug: "non steroidal anti-inflammatory drugs"
- Temporal: "history"
- Drug: "dexmedetomidine"
- Qualifier: "other"
- Drug: "drugs"
- Condition: "allergy"
- Observation: "cannot communicate"
- Measurement: "preoperative systolic blood pressure"
- Value: "<90 mmHg"
- Measurement: "heart rate"
- Value: "<50/min"